Clinical trial exclusion criterion:
Participated in other clinical studies in the last 30 days

Entity relations:
- Has_temporal("Participated in other clinical studies", "the last 30 days")